Patient included in an interventional study assessing treatment for active proctitis or distal proctosigmoiditis.

The above is a clinical trial exclusion criterion. Annotated with entity spans:
Patient included in an interventional study assessing [Procedure: treatment] for [Condition: active proctitis] or [Condition: distal proctosigmoiditis].